Clinical trial exclusion criteria:
amide and/or esther local anaesthetic allergy
paraben allergy
Child-Pugh grade B/C liver failure
renal insufficiency (calculated glomerular filtration rate under 60 ml/min/1.73 m2 according to Cockcroft-Gault scale )
dementia
those presenting with swallowing problem
chronic pain condition
chronic use of pain medication
pregnancy
lactation

Annotated entities:
- Drug: "amide local anaesthetic"
- Drug: "esther local anaesthetic"
- Condition: "allergy"
- Condition: "allergy"
- Drug: "paraben"
- Measurement: "Child-Pugh grade"
- Value: "B"
- Value: "C"
- Condition: "liver failure"
- Condition: "renal insufficiency"
- Measurement: "calculated glomerular filtration rate"
- Value: "under 60 ml/min/1.73 m2"
- Qualifier: "Cockcroft-Gault scale"
- Condition: "dementia"
- Condition: "swallowing problem"
- Condition: "chronic pain condition"
- Multiplier: "chronic use"
- Drug: "pain medication"
- Condition: "pregnancy"
- Condition: "lactation"